Clinical trial exclusion criterion:
Significant pulmonary disease, (e.g., restrictive pulmonary disease, constrictive or COPD) or any other disease or malfunction of the lungs or respiratory system that produces chronic symptoms

Entity relations:
- Has_qualifier("pulmonary disease", "Significant")
- Subsumes("pulmonary disease", "restrictive pulmonary disease")
- OR("restrictive pulmonary disease", "COPD")